一位65歲女性病患因為血便，到胃腸科門診求診。經問診及理學檢查後，醫師建議進行大腸鏡檢查，也告知大腸鏡檢查的相關風險，經病患同意後進行大腸鏡檢查。大腸鏡發現乙狀結腸處有1.5公分大小瘜肉，黏膜呈不規則狀，有接觸性出血，懷疑可能為大腸癌。醫師當場切除該大型瘜肉，並在切除處用金屬夾，做出血或穿孔的預防性處理，手術進行順利。病患回家後，隔天開始覺得腹痛、胃口變差、噁心感。到急診就醫，發現大腸穿孔。下列關於醫師是否有醫療過失的相關敘述，何者最為正確？
A. 該醫師僅告知大腸鏡檢查的相關風險，並未告知大腸瘜肉切除的相關風險，已經明顯違反了醫師的告知義務
B. 大腸鏡檢查以及大腸鏡合併瘜肉切除術，兩者本來都有大腸穿孔之相關風險，兩者風險種類一致，因此無需再特別告知大腸穿孔之風險
C. 大腸鏡檢查與大腸合併瘜肉切除術，都一樣有大腸穿孔之風險，但兩者風險程度有別，如果大腸鏡檢查前，可以分別告知不同的風險會比較妥當，但是否有違反告知義務，應該具體檢視個案相關事實加以認定
D. 該大腸瘜肉切除術，係有利於病患的最佳利益，可以直接加以切除，無需病患同意

正確答案：C. 大腸鏡檢查與大腸合併瘜肉切除術，都一樣有大腸穿孔之風險，但兩者風險程度有別，如果大腸鏡檢查前，可以分別告知不同的風險會比較妥當，但是否有違反告知義務，應該具體檢視個案相關事實加以認定